5. Transmural myocardial infarction within the previous seven days and CK has not returned to normal;

The above is a clinical trial exclusion criterion. Annotated with entity spans:
5. [Procedure: Transmural myocardial infarction] [Temporal: within the previous seven days] and [Measurement: CK] [Negation: has not returned] to [Value: normal];